Current use of systemic corticosteroids in the 3 months prior this study.

The above is a clinical trial exclusion criterion. Annotated with entity spans:
[Temporal: Current] use of [Drug: systemic corticosteroids] [Temporal: in the 3 months prior this study].